Unstable medical illness that requires immediate medical care

The above is a clinical trial exclusion criterion. Annotated with entity spans:
[Non-query-able: Unstable medical illness that requires immediate medical care]